El blastocisto se desprende de la zona pelúcida en:
1. El ovario.
2. La trompa de Falopio.
3. Tubo oviductal.
4. El útero.
5. La vagina.

Respuesta correcta: 4. El útero.